Clinical trial exclusion criterion:
Subject requiring a spine DEXA (i.e., patients with SCORE of = 6) with a T Score less than -2.0 at the index level. For patients with a herniation at L5/S1, the average T score of L1-L4 shall be used.

Annotated entities:
- Procedure: "spine DEXA"
- Measurement: "SCORE"
- Value: "= 6"
- Measurement: "T Score"
- Value: "less than -2.0"
- Qualifier: "index level"
- Mood: "requiring"
- Condition: "herniation"
- Qualifier: "L5/S1"
- Measurement: "average T score"
- Qualifier: "L1-L4"
- Non-representable: "shall be used"